Ischemic heart disease

The above is a clinical trial exclusion criterion. Annotated with entity spans:
[Condition: Ischemic heart disease]